Taking methotrexate without adequate control of symptoms

The above is a clinical trial inclusion criterion. Annotated with entity spans:
Taking [Drug: methotrexate] [Negation: without] [Observation: adequate control of symptoms]